舌癌病人接受全舌切除後，在吞嚥時容易有口中食物後送功能不足，下列何種方法對他最恰當？
A. 進食時，進行孟德森吞嚥手法（Mendelsohn maneuver）
B. 平時進行Shaker運動（Shaker exercise）
C. 進食時抬下巴（chin-up）
D. 平時進行Masako運動（Masako exercise）

正確答案：C. 進食時抬下巴（chin-up）